CMV seropositive

The above is a clinical trial inclusion criterion. Annotated with entity spans:
[Condition: CMV seropositive]